Clinical trial exclusion criterion:
previous UTI in the past 2 weeks

Entity relations:
- Has_temporal("UTI", "past 2 weeks")